Clinical trial exclusion criterion:
known allergy to tranexamic acid/Cyklokapron®

Entity relations:
- Subsumes("tranexamic acid", "Cyklokapron")
- AND("allergy", "tranexamic acid")